Clinical trial inclusion criterion:
Presence of at least 2 ischemic digital cutaneous ulcerations on two different fingers, with digital ulcers classified as "active ulcers" according to the North American working group definition: epithelial denudation is clearly Visible at one place and the bed of de-epithelialized ulcer can be seen; Ulcerations distal to the proximal interphalangeal joint, not associated with calcinosis or bony relief.

Annotated entities:
- Multiplier: "at least 2 on two different fingers"
- Condition: "ischemic digital cutaneous ulcerations"
- Condition: "digital ulcers"
- Qualifier: "active"
- Measurement: "North American working group definition"
- Qualifier: "epithelial denudation is clearly Visible at one place and the bed of de-epithelialized ulcer can be seen; Ulcerations distal to the proximal interphalangeal joint, not associated with calcinosis or bony relief"